Clinical trial exclusion criterion:
11. History of learning disability or current ADHD

Annotated entities:
- Parsing_Error: "11."
- Condition: "learning disability"
- Temporal: "current"
- Temporal: "History"
- Condition: "ADHD"